Which is the primary interacting protein of BLK?

a genetic interaction between BANK1 and BLK, and demonstrates that these molecules interact physically.